Clinical trial exclusion criterion:
Hypoalbuminemia defined as serum albumin <2.0g/dL

Annotated entities:
- Condition: "Hypoalbuminemia"
- Measurement: "serum albumin"
- Value: "<2.0g/dL"